一位 54 歲婦女主訴兩側下肢無力，無法從椅子站起已 2 個月；最近梳頭髮也覺得有些困難。同時，喝水也常嗆到咳嗽不已。理學檢查發現兩側肢體近端肌肉（proximal muscles）力量為第三級（grade Ⅲ），理學檢查感覺（sensation）正常，抽血檢驗發現其肌肉酵素 CK 值高達 5410 units/L，下列那一項實驗室檢查最不具診斷價值？
A. 肌電圖
B. 測 Anti-histidyl-transfer-RNA synthetase 抗體
C. 肌肉病理切片
D. 四肢神經傳導速度檢測

正確答案：D. 四肢神經傳導速度檢測